La función principal del retículo endoplasmático liso es:
1. Síntesis de proteínas.
2. Síntesis de lípidos.
3. Dirigir el tráfico de las proteínas una vez sintetizada.
4. Síntesis de polisacáridos.

Respuesta correcta: 2. Síntesis de lípidos.